Clinical trial exclusion criterion:
Previous history of receiving the rabies vaccine.

Annotated entities:
- Drug: "rabies vaccine"
- Temporal: "Previous history"